Active drug or alcohol use or dependence that, in the opinion of the site investigator, would interfere with adherence to study requirements.

The above is a clinical trial exclusion criterion. Annotated with entity spans:
[Temporal: Active] [Condition: drug] or [Condition: alcohol use or dependence] that, in the opinion of the site investigator, would interfere with adherence to study requirements.